Clinical trial exclusion criterion:
Patients incapable to understanding and will;

Entity relations:
- OR("incapable to understanding", "will incapable to")